Clinical trial exclusion criterion:
Skin lesions in the area

Annotated entities:
- Condition: "Skin lesions"